Clinical trial inclusion criterion:
The control group will be matched by the following parameters: age, skin color and type, and indication for peeling, and will be picked up by the dermatologist.

Entity relations:
- Has_context("age", "control group")
- Has_context("skin color", "control group")
- Has_context("type", "control group")